Pregnant or nursing (lactating) women, where pregnancy is defined as the state of a female after conception and until the termination of gestation, confirmed by a positive hcG laboratory test.

The above is a clinical trial exclusion criterion. Annotated with entity spans:
[Observation: Pregnant] or [Observation: nursing] ([Observation: lactating]) [Person: women], where pregnancy is defined as the state of a female after conception and until the termination of gestation, confirmed by a [Value: positive] [Observation: hcG laboratory test].